Clinical trial exclusion criterion:
Known proved BKV nephropathy

Annotated entities:
- Qualifier: "proved"
- Condition: "BKV nephropathy"